Uni-dimensionally measurable disease according to Response Evaluation Criteria in Solid Tumours (RECIST) v1.1

The above is a clinical trial inclusion criterion. Annotated with entity spans:
[Value: Uni-dimensionally measurable] [Condition: disease] according to [Measurement: Response Evaluation Criteria in Solid Tumours (RECIST) v1.1]